Clinical trial inclusion criterion:
Objectively confirmed diagnosis of acute PE by multidetector CT angiography, ventilation/perfusion lung scan, or selective invasive pulmonary angiography, according to established diagnostic criteria, with or without symptomatic deep vein thrombosis

Annotated entities:
- Qualifier: "acute"
- Condition: "PE"
- Procedure: "CT angiography"
- Procedure: "ventilation/perfusion lung scan"
- Procedure: "invasive pulmonary angiography,"
- Condition: "deep vein thrombosis"